單純疹病毒（Herpes simplex virus）之治療藥物樂威素（Acyclovir），其抑制病毒複製之機轉為何？
A. 阻止病毒胸腺激（thymidine kinase）作用
B. 阻止病毒 DNA 之複製
C. 阻止病毒附著於寄主細胞上
D. 阻止病毒之解體（uncoating）

正確答案：B. 阻止病毒 DNA 之複製